planned eye surgery under sedation

The above is a clinical trial inclusion criterion. Annotated with entity spans:
[Mood: planned] [Procedure: eye surgery] [Qualifier: under sedation]